下列有關陰道滴蟲（Trichomonas vaginalis）或其引起的病症，何者錯誤？
A. 性伴侶中，男性如果沒有症狀可不必投藥，只需治療出現症狀的女方即可
B. 沒有保蟲宿主（reservoir host）
C. 女性患者之症狀包括陰道搔癢、白帶增多且常呈黃綠色等
D. 根據非洲的研究顯示，陰道滴蟲症（vaginal trichomoniasis）患者感染HIV的機率較高

正確答案：A. 性伴侶中，男性如果沒有症狀可不必投藥，只需治療出現症狀的女方即可